Clinical trial exclusion criterion:
Severe deformity (varus or values from mechanical axis more than 5 degrees

Annotated entities:
- Qualifier: "Severe"
- Condition: "deformity"
- Condition: "varus"
- Measurement: "values from mechanical axis"
- Value: "more than 5 degrees"